Clinical trial inclusion criterion:
Written informed consent.

Annotated entities:
- Observation: "Written informed consent"